關於扁平苔癬 （lichen planus）敘述，下列何者錯誤？
A. 偏紫色的扁平丘疹或斑塊
B. 多無臨床症狀
C. 病灶常呈多角型
D. 可以外用類固醇治療

正確答案：B. 多無臨床症狀